Clinical trial exclusion criterion:
13. attempt of suicide in the last 2 years or at suicidal risk assessed by SCID interview;

Entity relations:
- AND("at suicidal risk", "SCID interview")
- Has_temporal("attempt of suicide", "in the last 2 years")
- OR("attempt of suicide", "at suicidal risk")